60 歲男病人因下肢水腫兩天，且尿量減少就診。病人有高血壓多年，近半年的降血壓藥物包括 trichlorothiazide、atenolol 和 losartan。他的血壓控制在 125~140/75~85 mmHg。三天前因腰部扭傷，服 用 naproxen。下列那個處置最為合適？
A. 停止服用 atenolol
B. 停止服用 naproxen
C. 安排腎臟組織切片檢查
D. 停止服用 trichlorothiazide

正確答案：B. 停止服用 naproxen